Hypersensitivity to bisoprolol or to any of the excipients.

The above is a clinical trial exclusion criterion. Annotated with entity spans:
[Condition: Hypersensitivity] to [Drug: bisoprolol] or to [Qualifier: any] of the [Drug: excipients].